BMI >40 Kg/ mm

The above is a clinical trial exclusion criterion. Annotated with entity spans:
[Observation: BMI] [Value: >40 Kg/ mm]